一位 40 歲男性，抽菸長達二十年，最近體檢發現肺部右側上葉有 2 公分的結節，經正子攝影及腦部與胸部電腦斷層檢查發現，只有同側肺門淋巴結侵犯，經切片證實為非小細胞肺癌，病人應接受何種治療最為適當？
A. 手術切除，術後觀察即可
B. 手術切除及術後輔助性化學治療
C. 放射治療
D. 使用 Gefitinib

正確答案：B. 手術切除及術後輔助性化學治療